Clinical trial exclusion criterion:
Lack of the patient's consent for the trial participation, feeding tube insertion or epidural analgesia

Annotated entities:
- Informed_consent: "Lack of the patient's consent for the trial participation, feeding tube insertion or epidural analgesia"